Clinical trial exclusion criteria:
Prior treatment with cisplatin before randomization
Uncontrolled concurrent disease
Pregnancy

Annotated entities:
- Drug: "cisplatin"
- Temporal: "before randomization"
- Reference_point: "randomization"
- Condition: "concurrent disease"
- Qualifier: "Uncontrolled"
- Condition: "Pregnancy"